Juan, residente de segundo año, atiende en urgencias a Sofía, una muchacha de 15 años que, al parecer, se ha desmayado en la escuela sin llegar a perder la conciencia. La paciente cuenta que estaba pendiente de realizar un examen, lo que le causaba mucha ansiedad. Por el interrogatorio, parece entreverse una situación de cierto acoso por parte de sus compañeros y la posibilidad de que sufra un trastorno alimentario. Las constantes vitales y exploración neurológica son normales. Juan mantiene a Sofía en observación a la espera de que sus padres acudan al servicio echando, periódicamente, una ojeada a cómo se encuentra la paciente. Tras el susto inicial, la paciente parece encontrarse cada vez más animada y es muy simpática. En una ocasión, Juan la encuentra chateando activamente con su móvil. Juan le indica que sería mejor que dejase el móvil y descansase y para tranquilizarla, le cuenta que él también utiliza mucho las redes sociales desde la facultad. Sofía pide perdón por desconocer que tenía que tener el móvil apagado, y tras apagarlo, le pregunta si podrá hacerle una solicitud de amistad en Facebook. ¿Cuál cree que es la mejor respuesta de Juan?:
1. Decirle que haga la solicitud de amistad y que la aceptará, pues está seguro de que en su página no hay elementos inapropiados para una chica de la edad de Sofía.
2. Dado que considera a Sofía una paciente vulnerable y le preocupa que pueda interpretar mal un rechazo, aceptar que haga la solicitud pero solamente permitirle el acceso a determinados contenidos de su página.
3. Contestarle que es importante mantener unos ciertos límites profesionales entre pacientes y facultativos y que, desafortunadamente, si hace la petición, no podrá aceptarla, por lo que mejor que no la haga.
4. Decirle que haga la petición pero sin intención de aceptarla.

Respuesta correcta: 3. Contestarle que es importante mantener unos ciertos límites profesionales entre pacientes y facultativos y que, desafortunadamente, si hace la petición, no podrá aceptarla, por lo que mejor que no la haga.